嚴重外傷之病患，術後需要足量營養補充，以維持各項生理功能與組織復原。營養補充是否足夠，可藉由下列各種生化檢定來評估，何者除外？
A. 白蛋白（albumin）
B. 球蛋白（globulin）
C. 前白蛋白（prealbumin）
D. 轉鐵蛋白（transferrin）

正確答案：B. 球蛋白（globulin）